Able to sign the consent form of anticipating in the study

The above is a clinical trial inclusion criterion. Annotated with entity spans:
[Informed_consent: Able to sign the consent form of anticipating in the study]